Subject has confirmed Pulmonary Hypertension and Interstitial Lung Disease

The above is a clinical trial inclusion criterion. Annotated with entity spans:
Subject has [Mood: confirmed] [Condition: Pulmonary Hypertension] and [Condition: Interstitial Lung Disease]